下列背部肌肉中，何者位於最深層？
A. 頭夾肌（splenius capitis）
B. 頭最長肌（longissimus capitis）
C. 頭半棘肌（semispinalis capitis）
D. 大後頭直肌（rectus capitis posterior major）

正確答案：D. 大後頭直肌（rectus capitis posterior major）